Pregnancy or breastfeeding (disproved by a negative pregnancy test before trial inclusion)

The above is a clinical trial exclusion criterion. Annotated with entity spans:
[Condition: Pregnancy] or [Observation: breastfeeding] ([Negation: disproved by] a [Value: negative] [Procedure: pregnancy test] [Temporal: before trial inclusion])